Clinical trial exclusion criterion:
Absence of documentation of age-appropriate cancer screening at the time of randomization

Entity relations:
- Has_qualifier("cancer screening", "age-appropriate")
- Has_index("at the time of randomization", "the time of randomization")
- Has_temporal("cancer screening", "at the time of randomization")